Clinical trial exclusion criterion:
Previous antispastic drugs

Annotated entities:
- Drug: "antispastic drugs"
- Temporal: "Previous"